Known hypersensibility to coumadin or indoine derivatives or to any excipients (CI to oral AVK)

The above is a clinical trial exclusion criterion. Annotated with entity spans:
Known [Condition: hypersensibility] to [Drug: coumadin] or [Drug: indoine] derivatives or to any excipients (CI to oral AVK)